Clinical trial inclusion criteria:
Provide signed and dated informed consent form.
Willing to comply with all study procedures and be available for the duration of the study.
Male or female, aged = 18 to = 60 years on day of inclusion.
In good general health based on medical history and physical exam

Annotated entities:
- Non-query-able: "Provide signed and dated informed consent form."
- Post-eligibility: "Willing to comply with all study procedures and be available for the duration of the study."
- Person: "Male"
- Person: "female"
- Person: "aged"
- Value: "= 18 to = 60 years"
- Temporal: "on day of inclusion"
- Condition: "good general health"
- Temporal: "medical history"
- Procedure: "physical exam"